20. Use of any investigational drug or therapy within 28 days before screening

The above is a clinical trial exclusion criterion. Annotated with entity spans:
[Parsing_Error: 20.] Use of any [Drug: investigational drug] or therapy [Temporal: within 28 days before screening]